一位 23 歲男性患者因為攻擊行為，致使路人受傷，被警察強制送至急診室。病史詢問時，發現患者近一週無法上班，睡眠每天不到 3 小時，說話滔滔不絕、亂花錢、情緒高昂、易怒、常與人發生口角，且自稱有超能力。此患者最有可能之臨床診斷為下列何者？
A. 雙極性疾患，躁症發作
B. 雙極性疾患，輕躁發作
C. 雙極性疾患，鬱症發作
D. 非特異性雙極性疾患

正確答案：A. 雙極性疾患，躁症發作